BMI > 18,5 <30 kg/m2

The above is a clinical trial inclusion criterion. Annotated with entity spans:
[Measurement: BMI] [Value: > 18,5 <30 kg/m2]